willingness to perform home glucose monitoring

The above is a clinical trial inclusion criterion. Annotated with entity spans:
[Non-query-able: willingness to perform home glucose monitoring]